Known major cognitive deficit dementia, history of head trauma with loss of consciousness >30 min, history of stroke, current central nervous system (CNS) disorder such as seizures or opportunistic CNS infection

The above is a clinical trial exclusion criterion. Annotated with entity spans:
Known major [Condition: cognitive deficit] [Condition: dementia], history of [Condition: head trauma] with [Condition: loss of consciousness] [Multiplier: >30 min], history of [Condition: stroke], current [Condition: central nervous system] (CNS) disorder such as [Condition: seizures] or [Condition: opportunistic CNS infection]